Person is using under arm axillary crutches or walker.

The above is a clinical trial exclusion criterion. Annotated with entity spans:
Person is using [Device: under arm axillary crutches] or [Device: walker].